Clinical trial exclusion criteria:
Severe Iron deficiency anemia (hemoglobin < 8.0 g/dL).
Parasitic worm infection e.g. schistosomiasis, and hook worm by stool analysis.
Any cases giving clinical symptoms of gastritis e.g. nausea, vomiting, dull aching pain or soreness in the epigastrium.
Cases with history of gastric ulcer diagnosed by upper endoscopy.
Cases complaining of hematemesis.

Annotated entities:
- Qualifier: "Severe"
- Condition: "Iron deficiency anemia"
- Measurement: "hemoglobin"
- Value: "< 8.0 g/dL"
- Condition: "Parasitic worm infection"
- Condition: "schistosomiasis"
- Condition: "hook worm"
- Procedure: "stool analysis"
- Mood: "clinical symptoms"
- Condition: "gastritis"
- Condition: "nausea"
- Condition: "vomiting"
- Condition: "dull aching pain"
- Condition: "soreness in the epigastrium"
- Condition: "gastric ulcer"
- Temporal: "history"
- Procedure: "upper endoscopy"
- Condition: "hematemesis"